Clinical trial exclusion criterion:
2. Patient has a diagnosis of bowel obstruction, bowel strangulation, peritonitis, bowel perforation, local or systemic infection, ischemic bowel, carcinomatosis or extensively spread inflammatory bowel disease.

Entity relations:
- Has_qualifier("inflammatory bowel disease", "extensively spread")
- OR("bowel obstruction", "bowel strangulation", "peritonitis", "bowel perforation", "local infection", "systemic infection", "ischemic bowel", "carcinomatosis", "inflammatory bowel disease")